Clinical trial exclusion criterion:
Active hepatobiliary disease

Annotated entities:
- Qualifier: "Active"
- Condition: "hepatobiliary disease"